Clinical trial inclusion criterion:
Diagnosis of type 2 diabetes (HbA1c > 48 mmol/mol)

Annotated entities:
- Condition: "type 2 diabetes"
- Measurement: "HbA1c"
- Value: "> 48 mmol/mol"